Fibromyalgia: by ACR (American College of Rheumatology) 2010 criteria

The above is a clinical trial inclusion criterion. Annotated with entity spans:
[Condition: Fibromyalgia]: by [Qualifier: ACR] ([Qualifier: American College of Rheumatology]) 2010 criteria